下列有關維生素缺乏引起之神經系統疾病的敘述，何者錯誤？
A. 亞急性聯合退化症（subacute combine degeneration）是缺乏維生素B12B
B. 克沙可夫症（Korsakoff syndrome）是缺乏維生素B1B
C. 神經性腳氣病（neuropathic beriberi）是缺乏維生素 B 群
D. 抗結核病藥物INH（isoniazid）之相關神經病變，是缺乏維生素B2B

正確答案：D. 抗結核病藥物INH（isoniazid）之相關神經病變，是缺乏維生素B2B